¿Cuál de los compuestos siguientes se forma directamente en una o más reacciones del ciclo del ácido cítrico?:
1. NADH.
2. ATP.
3. Ambos.
4. Ninguno.

Respuesta correcta: 1. NADH.